List signaling molecules (ligands) that interact with the receptor EGFR?

The 7 known EGFR ligands  are: epidermal growth factor (EGF), betacellulin (BTC), epiregulin (EPR), heparin-binding EGF (HB-EGF), transforming growth factor-α [TGF-α], amphiregulin (AREG) and epigen (EPG).